Viable tumor resection confirmed by two highly qualified surgical doctors;

The above is a clinical trial inclusion criterion. Annotated with entity spans:
[Subjective_judgement: Viable tumor resection confirmed by two highly qualified surgical doctors];